一籃球選手於灌籃時，遭劇烈碰撞，造成肱骨的外科頸骨折（fracture of surgical neck of the humerus），下列那些鄰近外科頸的構造最可能受傷？
A. 橈神經（radial nerve）與肩胛上動脈（suprascapular artery）
B. 腋神經（axillary nerve）與旋肱動脈（circumflex humeral artery）
C. 肩胛上神經（suprascapular nerve）與肩胛下動脈（subscapular artery）
D. 胸長神經（long thoracic nerve）與臂動脈（brachial artery）

正確答案：B. 腋神經（axillary nerve）與旋肱動脈（circumflex humeral artery）